Blood pressure <140/90 mmHg at Screening and D-1. Measurement may be repeated within 24 hours, based on Investigator judgment.

The above is a clinical trial inclusion criterion. Annotated with entity spans:
[Measurement: Blood pressure] [Value: <140/90 mmHg] [Temporal: at Screening and D-1]. [Parsing_Error: Measurement may be repeated within 24 hours, based on Investigator judgment.]